在下列抗心律不整藥中，何者 half-life 最短？
A. quinidine
B. lidocaine
C. bretylium
D. adenosine

正確答案：D. adenosine